Clinical trial inclusion criterion:
• Psoriasis (physician-diagnosed)

Annotated entities:
- Condition: "Psoriasis"